教導一般民眾對嬰兒及兒童實施心肺復甦術（cardiopulmonary resuscitation）時，壓胸及吹氣之比例為何？
A. 1歲以上至8歲為30：2
B. 1歲以下為15：2
C. 1歲以上至8歲為5：1
D. 1歲以下為5：1

正確答案：A. 1歲以上至8歲為30：2